65 歲男性患者，因呼吸困難接受肺功能檢查顯示為阻塞性換氣障礙，其 DLco 之測量值為正常預測值之 56%。下列何者為此患者最可能的診斷？
A. 氣喘症
B. 慢性支氣管炎
C. 肺氣腫
D. 心臟衰竭

正確答案：C. 肺氣腫